Clinical trial exclusion criterion:
Uncontrolled hypertension or metabolic disease

Entity relations:
- Has_qualifier("hypertension", "Uncontrolled")
- OR("hypertension", "metabolic disease")